Clinical trial exclusion criterion:
History of deep vein thrombosis or pulmonary embolism or prostate cancer or heart failure (Class III and IV).

Entity relations:
- Has_qualifier("heart failure", "Class III")
- OR("Class III", "Class IV")
- OR("deep vein thrombosis", "heart failure", "pulmonary embolism", "prostate cancer")